Clinical trial exclusion criterion:
initial blast crisis CML

Annotated entities:
- Qualifier: "blast crisis"
- Condition: "CML"